Pharmacological intervention (administration of corticosteroids, NSAIDs or paracetamol) or physical intervention (external cooling technique) that may influence temperature in the last 6 hours.

The above is a clinical trial exclusion criterion. Annotated with entity spans:
[Procedure: Pharmacological intervention] (administration of [Drug: corticosteroids], [Drug: NSAIDs] or [Drug: paracetamol]) or [Procedure: physical intervention] ([Procedure: external cooling technique]) [Qualifier: that may influence temperature] [Temporal: in the last 6 hours].